Women seeking medication abortion through 70 days gestation

The above is a clinical trial inclusion criterion. Annotated with entity spans:
[Person: Women] seeking [Procedure: medication abortion] [Temporal: through 70 days gestation]